¿Cuál de los siguientes fármacos poseen propiedades similares a la hormona adrenocorticotropa (ACTH)?:
1. Lanreótido.
2. Pegvisomant.
3. Ganirelix.
4. Tetracosáctido.

Respuesta correcta: 4. Tetracosáctido.